Clinical trial exclusion criterion:
Chronic kidney disease

Entity relations:
- Has_qualifier("kidney disease", "Chronic")